Clinical trial exclusion criterion:
Predominance of central apneas and hypopneas, defined as more than 25% of all respiratory events.

Annotated entities:
- Condition: "central apneas and hypopneas"
- Value: "more than 25%"
- Measurement: "all respiratory events"
- Condition: "Predominance"